Completed the CRISS questionnaire at Visit 1 and Visit 2 and willing to complete the Cystic Fibrosis Respiratory Symptoms Diary (CFRSD) questionnaire at Visit 3

The above is a clinical trial inclusion criterion. Annotated with entity spans:
Completed the [Procedure: CRISS questionnaire] [Temporal: at Visit 1] and [Reference_point: Visit 2] and [Mood: willing to complete] the [Procedure: Cystic Fibrosis Respiratory Symptoms Diary (CFRSD) questionnaire] [Temporal: at Visit 3]